15歲男生是學校游泳隊的成員，每日至少泳訓2小時，因左耳疼痛難耐而至耳鼻喉科就診，醫師檢查發現外耳發炎。經微生物培養鑑定為β型溶血，不發酵葡萄糖的細菌。最有可能是被下列何種細菌所感染？
A. 草綠群鏈球菌（Viridans streptococci）
B. 表皮葡萄球菌（Staphylococcus epidermidis）
C. 肺炎鏈球菌（Streptococcus pneumoniae）
D. 綠膿桿菌（Pseudomonas aeruginosa）

正確答案：D. 綠膿桿菌（Pseudomonas aeruginosa）